Clinical trial exclusion criterion:
Pregnancy at enrollment.

Entity relations:
- Has_index("at enrollment", "enrollment")